在表皮（epidermis）中，含量最多的細胞是：
A. 黑色素細胞（melanocytes）
B. 角質細胞（keratinocytes）
C. 蘭氏細胞（Langerhans cells）
D. 默氏細胞（Merkel cells）

正確答案：B. 角質細胞（keratinocytes）